Ongoing treatment with statins, fibrates, and/or cation exchange resins within 2 weeks;

The above is a clinical trial exclusion criterion. Annotated with entity spans:
[Temporal: Ongoing] [Procedure: treatment] with [Drug: statins], [Drug: fibrates], and/or [Drug: cation exchange resins] [Temporal: within 2 weeks];